Intra uterine device (IUD)

The above is a clinical trial exclusion criterion. Annotated with entity spans:
[Device: Intra uterine device (IUD)]